Not currently engaged in > 60 min/wk of exercise

The above is a clinical trial inclusion criterion. Annotated with entity spans:
[Negation: Not] [Temporal: currently] [Observation: engaged in] [Value: > 60 min/wk] of exercise